Clinical trial exclusion criterion:
Person is unwilling/unable to follow instructions.

Annotated entities:
- Post-eligibility: "Person is unwilling/unable to follow instruction"